Clinical trial inclusion criterion:
Greater than 4 months out from C-spine injury

Annotated entities:
- Condition: "C-spine injury"
- Temporal: "Greater than 4 month"